Clinical trial inclusion criterion:
Functional class II, III or IV by the New York Heart Association (NYHA)

Entity relations:
- Has_value("New York Heart Association (NYHA)", "Functional class II, III or IV")